Clinical trial exclusion criterion:
Severe renal failure with estimated glomerular filtration rate <30 ml/min

Annotated entities:
- Condition: "renal failure"
- Qualifier: "Severe"
- Measurement: "estimated glomerular filtration rate"
- Value: "<30 ml/min"